Clinical trial inclusion criterion:
Bilirubin level at/above 100 umol per liter (5.8 mg/dL)

Annotated entities:
- Measurement: "Bilirubin level"
- Value: "at/above 100 umol per liter"
- Value: "at/above 5.8 mg/dL"